List the different subtypes of thyroid cancer.

The different histologic subtypes of thyroid cancer include papillary, follicular, anaplastic, medullary, and Hürthle cell carcinomas.